Clinical trial inclusion criterion:
Able to complete full wrist flexion-extension bilaterally

Annotated entities:
- Procedure: "complete full wrist flexion-extension bilaterally"
- Mood: "Able to"